Recent unintentional weight change (+/- 10 lbs. in the last 12 months)

The above is a clinical trial exclusion criterion. Annotated with entity spans:
Recent unintentional [Measurement: weight] change ([Value: +/- 10 lbs.] in the [Temporal: last 12 months])